Judgement by the investigator that the patient is not able to participate in the study

The above is a clinical trial exclusion criterion. Annotated with entity spans:
[Subjective_judgement: Judgement by the investigator that the patient is not able to participate in the study]